Clinical trial inclusion criterion:
Adult patients aged (>18), males and females, undergoing elective coronary artery bypass graft (CABG) surgery with cardiopulmonary bypass (CPB).

Annotated entities:
- Person: "aged"
- Value: ">18"
- Person: "males"
- Person: "females"
- Qualifier: "elective"
- Procedure: "surgery coronary artery bypass graft"
- Procedure: "CABG"
- Procedure: "cardiopulmonary bypass"
- Procedure: "CPB"